下列何者穿行於胃脾韌帶內？
A. 左胃動脈
B. 脾動脈
C. 胃十二指腸動脈
D. 左胃網膜動脈

正確答案：D. 左胃網膜動脈